Allergies to study drugs.

The above is a clinical trial exclusion criterion. Annotated with entity spans:
[Condition: Allergies] to [Drug: study drugs].